Clinical trial inclusion criterion:
For patients >=60 years of age: any 2 of the following:

Entity relations:
- Has_value("age", ">=60 years")